一名 82 歲居住在安養中心的老翁，因三天未解便且出現腹脹、嘔吐等症狀而被送到急診。病患先前數月常有間歇性右上腹絞痛，腹部無手術疤痕、無腹股溝疝氣，腹部 X 光片除可看到明顯脹大之腸道外，尚可在右上腹觀察到樹枝狀的充氣結構，則此病患腸阻塞之原因最可能為：
A. 膽結石性腸阻塞
B. 腸道轉位異常
C. 腸沾黏
D. 小腸閉鎖

正確答案：A. 膽結石性腸阻塞